List symptoms of Meigs' Syndrome.

Meigs' syndrome is a benign ovarian tumor associated with ascites and pleural effusion.